Clinical trial inclusion criterion:
Subjects with residual refractive error.

Annotated entities:
- Condition: "residual refractive error"